Clinical trial inclusion criterion:
Consenting adults (18 years and older) who agrees and consents to skin biopsy and QSART procedure

Annotated entities:
- Post-eligibility: "Consenting adults (18 years and older) who agrees and consents to skin biopsy and QSART procedure"
- Non-query-able: "Consenting adults (18 years and older) who agrees and consents to skin biopsy and QSART procedure"